在病理檢查一死胎時，發現在其心臟兩側的心肌中有多個小的腫瘤狀病變，顯微鏡下病變中細胞含有多量肝糖，並呈蜘蛛狀細胞（spider cells）。下列何者最符合上述的病理變化？
A. Fibroelastoma
B. Angiosarcoma
C. Myxoma
D. Rhabdomyoma

正確答案：D. Rhabdomyoma